Clinical trial exclusion criterion:
Use of Ginkgo biloba or St. John's Wort within 14 days before first dose of study drug

Entity relations:
- Has_multiplier("study drug", "first dose")
- multi("first dose of study drug", "study drug")
- Has_index("within 14 days before first dose of study drug", "first dose of study drug")
- Has_temporal("Ginkgo biloba", "within 14 days before first dose of study drug")
- OR("Ginkgo biloba", "St. John's Wort")